ACT score <20 at randomization visit (visit 2).

The above is a clinical trial inclusion criterion. Annotated with entity spans:
[Measurement: ACT score] [Value: <20] [Temporal: at randomization visit] (visit 2).